Clinical trial exclusion criteria:
Previously enrolled in this study (i.e. patient now at repeat encounter)
Concomitant surgical procedure other than CABG
Anticoagulant treatment after the operation (e.g. warfarin, direct thrombin inhibitors (dabigatran), FXa inhibitors (rivaroxaban, apixaban, heparin, low-molecular weight heparin, fondaparinux)
Discharge from the operating hospital to an ICU at another hospital
Pregnancy or lactation
Known intolerance or contraindication to ticagrelor or ASA
Any disorder that may interfere with drug absorption
Any condition other than coronary artery disease with a life expectancy <12 months
Known chronic liver disease, renal disease requiring dialysis or bleeding disorder
Atrioventricular block II and III in patients without pacemaker
Any other indication for dual antiplatelet therapy, i.e. recent stent implantation
Debilitating stroke within 90 days before inclusion
Previous intracranial bleeding
Treatment with immunosuppressants (e.g. cyclosporine and tacrolimus)
Treatment with strong CYP3A4-inhibitors (e.g. ketoconazole, clarithromycin, nefazodone, ritonavir or atazanavir)
Any condition that in the opinion of the investigator may interfere with adherence to trial protocol

Annotated entities:
- Observation: "enrolled in this study"
- Temporal: "Previously"
- Procedure: "surgical procedure"
- Temporal: "Concomitant"
- Procedure: "CABG"
- Qualifier: "other than"
- Procedure: "Anticoagulant treatment"
- Temporal: "after the operation"
- Reference_point: "the operation"
- Procedure: "operation"
- Drug: "warfarin"
- Drug: "direct thrombin inhibitors"
- Drug: "dabigatran"
- Drug: "FXa inhibitors"
- Drug: "rivaroxaban"
- Drug: "apixaban"
- Drug: "heparin"
- Drug: "low-molecular weight heparin"
- Drug: "fondaparinux"
- Observation: "Discharge"
- Visit: "operating hospital"
- Visit: "ICU"
- Qualifier: "another"
- Visit: "hospital"
- Condition: "Pregnancy"
- Condition: "lactation"
- Condition: "contraindication"
- Condition: "intolerance"
- Drug: "ticagrelor"
- Drug: "ASA"
- Condition: "disorder"
- Qualifier: "may interfere with drug absorption"
- Condition: "coronary artery disease"
- Negation: "other than"
- Condition: "condition"
- Observation: "life expectancy"
- Value: "<12 months"
- Condition: "chronic liver disease"
- Condition: "renal disease"
- Procedure: "dialysis"
- Condition: "bleeding disorder"
- Mood: "requiring"
- Condition: "Atrioventricular block II"
- Condition: "Atrioventricular block III"
- Negation: "without"
- Device: "pacemaker"
- Condition: "dual antiplatelet therapy"
- Procedure: "stent implantation"
- Temporal: "recent"
- Condition: "indication"
- Temporal: "within 90 days before inclusion"
- Condition: "stroke"
- Condition: "Debilitating"
- Temporal: "Previous"
- Procedure: "intracranial bleeding"
- Drug: "immunosuppressants"
- Drug: "cyclosporine"
- Drug: "tacrolimus"
- Drug: "strong CYP3A4-inhibitors"
- Drug: "ketoconazole"
- Drug: "clarithromycin"
- Drug: "nefazodone"
- Drug: "ritonavir"
- Drug: "atazanavir"
- Non-query-able: "Any condition that in the opinion of the investigator may interfere with adherence to trial protocol"